有關心臟移植病人在運動時的心跳反應，下列何者錯誤？
A. 在運動開始後，心跳率不會馬上增加
B. 其基礎心跳率較正常人為低
C. 其最大心跳率較正常人為低
D. 運動停止後，心跳率仍會繼續上升達一至二分鐘

正確答案：B. 其基礎心跳率較正常人為低